Clinical trial inclusion criterion:
Highly active RMS as defined by:

Annotated entities:
- Qualifier: "Highly active"
- Condition: "RMS"
- Non-representable: "as defined by:"